Clinical trial exclusion criterion:
Total bilirubin > 3 mg/dl

Annotated entities:
- Measurement: "Total bilirubin"
- Value: "> 3 mg/dl"